Clinical trial inclusion criterion:
adult patients aged = 55 years with

Annotated entities:
- Person: "adult"
- Person: "aged"
- Value: "= 55 years"